Patients agreed to actively participate in the rehabilitation protocol and follow-up program;

The above is a clinical trial inclusion criterion. Annotated with entity spans:
Patients [Observation: agreed to actively participate in the rehabilitation protocol] and follow-up program;